Clinical trial exclusion criterion:
Inability to use a PCA device or speak the English language

Entity relations:
- AND("Inability to use", "PCA device")
- OR("Inability to use", "Inability to speak the English language")